Clinical trial exclusion criterion:
Recent unintentional weight change (+/- 10 lbs. in the last 12 months)

Entity relations:
- Has_value("weight", "+/- 10 lbs.")
- Has_temporal("weight", "last 12 months")